Clinical trial exclusion criterion:
Abnormal Coagulation (INR>1.5<U+3001>APTT>1.5 UNL), with tendency of bleed;

Annotated entities:
- Condition: "Abnormal Coagulation"
- Measurement: "INR"
- Value: ">1.5"
- Measurement: "APTT"
- Value: ">1.5 UNL"
- Condition: "tendency of bleed"